Clinical trial exclusion criterion:
Platelets < 75 x 109 cells/L.

Annotated entities:
- Measurement: "Platelets"
- Value: "< 75 x 109 cells/L"